What is the mechanism of action of Alpelisib?

Alpelisib is selective inhibitor of Phosphatidylinositol 3-Kinase α (PI3Kα). It is used for treatment of cancer.